taking any prescription pain/ insulin medication

The above is a clinical trial exclusion criterion. Annotated with entity spans:
taking any [Drug: prescription pain]/ insulin medication